Posee células superficiales con abundante glucógeno:
1. Lengua.
2. Esófago.
3. Piel fina.
4. Vagina.
5. Piel gruesa.

Respuesta correcta: 4. Vagina.